有一兩歲兒童因腹痛而住院。超音波報告為"Cystic dilatation of the common bile duct, intrahepatic ducts are normal＂，你的診斷為：
A. Choledochal cyst typeⅠ
B. Choledochal cyst typeⅡ
C. Choledochal cyst type Ⅲ
D. Choledochal cyst type Ⅳ

正確答案：A. Choledochal cyst typeⅠ